Lung resection or transplantation: Subjects with lung volume reduction surgery within the 12 months prior to Screening or having had a lung transplant.

The above is a clinical trial exclusion criterion. Annotated with entity spans:
[Procedure: Lung resection] or [Procedure: transplantation]: Subjects [Condition: with lung volume reduction surgery] [Temporal: within the 12 months prior to Screening] or [Condition: having had a lung transplant].